Clinical trial exclusion criterion:
Patients that are known to be positive for Human Immunodeficiency Virus (HIV) (HIV 1/2 antibodies), active Hepatitis B (HBsAg reactive), or Hepatitis C (HCV RNA [qualitative] is detected); patients with negative Hepatitis C antibody testing may not need RNA testing.

Entity relations:
- Has_qualifier("Human Immunodeficiency Virus (HIV)", "HIV 1/2 antibodies")
- Has_value("Human Immunodeficiency Virus (HIV)", "positive")
- Has_value("HBsAg", "reactive")
- Subsumes("active Hepatitis B", "HBsAg")
- Has_value("HCV RNA [qualitative]", "detected")
- AND("Hepatitis C", "HCV RNA [qualitative]")
- Has_value("Hepatitis C antibody", "negative")
- OR("Human Immunodeficiency Virus (HIV)", "Hepatitis C", "active Hepatitis B")